一位 65 歲男性病人因攝護腺癌合併骨骼轉移，接受 LHRH agonist 治療，經一段時間骨頭疼痛改善 ，14 個月後，病人開始有腰部下方及右側髖關節部分疼痛，此時檢查發現其 serum testosterone 仍
 2  g/mL，但血清中 PSA 濃度逐漸上昇，此時病人之症狀最可能是因為：
A. 病人之荷爾蒙治療不完全
B. 疾病進行成 hormone refractory
C. 脊髓神經即將被壓迫
D. 對男性荷爾蒙敏感（androgen-sensitive）之腫瘤發生 tachyphylaxis 反應

正確答案：B. 疾病進行成 hormone refractory